Clinical trial exclusion criterion:
Bleeding site is in, around, or in proximity to foramina in bone, or areas of bony confine.

Annotated entities:
- Non-query-able: "Bleeding site is in, around, or in proximity to foramina in bone, or areas of bony confine"